Clinical trial inclusion criterion:
Subject has known CD and a recent history (within last 2 years) of mucosal disease (diagnosis based on radiologic, endoscopic, or histological evidence).

Entity relations:
- Has_context("mucosal disease", "radiologic evidence")
- Has_temporal("mucosal disease", "recent history")
- Has_temporal("recent history", "within last 2 years")
- OR("radiologic evidence", "endoscopic evidence", "histological evidence")